下列有關三叉神經痛（Trigeminal Neuralgia）之治療，何者成功率比較低？
A. 藥物：Tegretol 及 Neurontin
B. 顯微血管減壓術（microvascular decompression）
C. 經皮下神經剝除術（percutaneous nerve ablation）
D. 伽傌刀放射手術（Gamma knife surgery）

正確答案：C. 經皮下神經剝除術（percutaneous nerve ablation）